下列何項肺功能值可用來作為評估與監測氣喘嚴重度的指標？
A. 肺總容量（total lung capacity）
B. 肺活量（vital capacity）
C. 尖峰呼氣流速（peak expiratory flow）
D. 肺殘餘容積（residual volume）

正確答案：C. 尖峰呼氣流速（peak expiratory flow）